History of a sunny holiday, UV-light therapy or solarium use within one month before beginning of study treatments, or planning such during the study or within 7 days after the study

The above is a clinical trial exclusion criterion. Annotated with entity spans:
History of a [Observation: sunny holiday], [Procedure: UV-light therapy] or [Observation: solarium use] [Temporal: within one month before beginning of study treatments], or [Mood: planning] such [Temporal: during the study] or [Temporal: within 7 days after the study]